Clinical trial exclusion criterion:
child has a history of a condition that requires a beta blocker medicine for cardiac conditions, high blood pressure, migraine headaches, or eye drops for glaucoma (e.g. propranolol, metoprolol, atenolol and Timoptic®, or Betoptic® eye drops).

Entity relations:
- Subsumes("eye drops", "Betoptic")
- AND("glaucoma", "eye drops")
- AND("cardiac conditions", "beta blocker medicine")
- Subsumes("eye drops", "propranolol")
- OR("cardiac conditions", "high blood pressure", "migraine headaches")
- OR("propranolol", "metoprolol", "atenolol", "Timoptic", "eye drops")
- OR("cardiac conditions", "glaucoma")